Clinical trial exclusion criterion:
Past history of hypersensitivity to aripiprazole

Entity relations:
- AND("hypersensitivity", "aripiprazole")